Clinical trial exclusion criterion:
Family history of ARF

Entity relations:
- Has_context("ARF", "Family history")